Clinical trial exclusion criterion:
Current substance use disorder according to the Diagnostic and Statistical Manual of Mental Disorders Fifth Edition (DSM 5)

Entity relations:
- Has_qualifier("substance use disorder", "Diagnostic and Statistical Manual of Mental Disorders Fifth Edition (DSM 5)")